在腹直肌鞘的弓狀線與恥骨聯合之間，下列何者位於腹直肌的後側？
A. 腹外斜肌腱膜
B. 腹內斜肌腱膜
C. 腹橫肌腱膜
D. 腹橫筋膜

正確答案：D. 腹橫筋膜